有關前列腺癌荷爾蒙治療的敘述，下列何者錯誤？
A. 荷爾蒙治療是指儘量抑制（suppress）身體內男性荷爾蒙，因為男性荷爾蒙對前列腺癌細胞來說，是一種刺激生長因子
B. 雙側睪丸切除算是一種荷爾蒙治療
C. 單次注射黃體素釋放激素促進劑（luteinizing hormone releasing hormone agonist）也可以達成荷爾蒙治療
D. 長期荷爾蒙治療可能有骨質疏鬆、貧血、疲倦等副作用

正確答案：C. 單次注射黃體素釋放激素促進劑（luteinizing hormone releasing hormone agonist）也可以達成荷爾蒙治療